Clinical trial exclusion criterion:
Glomerular filtration rate <30mL/minute or on dialysis

Entity relations:
- Has_value("Glomerular filtration rate", "<30mL/minute")
- OR("Glomerular filtration rate", "dialysis")